Other contra-indications to liraglutide in accordance with risks and safety information included in the latest updated prescribing information

The above is a clinical trial exclusion criterion. Annotated with entity spans:
[Qualifier: Other] [Condition: contra-indications] to [Drug: liraglutide] in accordance with risks and safety information included in the latest updated prescribing information